Clinical trial exclusion criterion:
previous Helicobacter Pylori eradication treatment

Annotated entities:
- Procedure: "Helicobacter Pylori eradication treatment"